類固醇生成急性調節蛋白質（steroidogenic acute regulatory protein）的主要功能為促進：
A. 膽固醇進入粒線體內膜
B. 膽固醇進入腎上腺髓質細胞
C. 膽固醇與低密度脂蛋白（LDL）結合
D. 膽固醇在肝臟的生成

正確答案：A. 膽固醇進入粒線體內膜